下列抗憂鬱藥中，何種屬於 monoamine oxidase inhibitors？
A. selegiline
B. paroxetine
C. imipramine
D. bupropion

正確答案：A. selegiline